Clinical trial inclusion criterion:
Patients treated by a calcineurin inhibitor and mycophenolic acid

Annotated entities:
- Drug: "calcineurin inhibitor"
- Drug: "mycophenolic acid"